Clinical trial exclusion criterion:
Chronic retention

Annotated entities:
- Condition: "Chronic retention"